關於異位性皮膚炎的敘述，下列何者正確？
A. 血清E型免疫球蛋白（IgE）偏低
B. 常出現紅色皮膚劃紋症（red dermatographism）
C. 手掌與腳掌掌紋變少（hypolinearity of palms and soles）
D. 可合併尋常性魚	癬（ichthyosis vulgaris）

正確答案：D. 可合併尋常性魚	癬（ichthyosis vulgaris）